What is the prevalence of poor metabolizers of CYP2C19 among Southern Asians compared to East Asians?

Southeast Asians exhibit a higher prevalence of CYP2C19-poor metabolisers compared with Caucasians and East Asians.